Clinical trial inclusion criterion:
M1 (5%) or M2 (= 5% to < 25%) blasts in bone marrow on day 15;

Annotated entities:
- Line: "M1 (5%) or M2 (= 5% to < 25%) blasts in bone marrow on day 15"
- Measurement: "M1 blasts"
- Measurement: "M2 blasts"
- Qualifier: "bone marrow"
- Value: "(5%"
- Value: "= 5% to < 25%"
- Temporal: "on day 15"